Clinical trial exclusion criterion:
Pregnant women and young children aged <18 years;

Entity relations:
- Has_value("aged", "<18 years")